Clinical trial exclusion criterion:
History of another malignancy except: Malignancy treated with curative intent and with no known active disease present for >=5 years prior to enrolment and felt to be at low risk for recurrence by the treating physician; Adequately treated non-melanomatous skin cancer or lentigo maligna without evidence of disease; Adequately treated cervical carcinoma in situ without evidence of disease; Prostatic intraepithelial neoplasia without evidence of prostate cancer.

Annotated entities:
- Qualifier: "another"
- Condition: "malignancy"
- Condition: "Malignancy"
- Procedure: "treated with curative intent"
- Negation: "no"
- Condition: "active disease"
- Temporal: "for >=5 years prior to enrolment"
- Reference_point: "enrolment"
- Mood: "felt to be at low risk"
- Condition: "recurrence"
- Qualifier: "Adequately"
- Condition: "non-melanomatous skin cancer"
- Procedure: "treated"
- Condition: "lentigo maligna"
- Condition: "evidence of disease"
- Negation: "without"
- Qualifier: "Adequately"
- Procedure: "treated"
- Condition: "cervical carcinoma in situ"
- Negation: "without"
- Condition: "disease"
- Condition: "Prostatic intraepithelial neoplasia"
- Condition: "prostate cancer"
- Negation: "without"
- Mood: "evidence of"
- Mood: "evidence of"
- Negation: "except"